Inborn errors of metabolism that need protocol-determined fluid therapy

The above is a clinical trial exclusion criterion. Annotated with entity spans:
[Condition: Inborn errors of metabolism] that [Mood: need] [Qualifier: protocol-determined] [Procedure: fluid therapy]